Clinical trial exclusion criterion:
Ongoing substance use disorder with significant impact on activities of daily living. Difficult or impossible to determine whether cognitive or functional decline is due to substance use or HIV, or both

Entity relations:
- Has_temporal("substance use disorder", "Ongoing")
- AND("substance use disorder", "impact on activities of daily living")